有關與血脂異常相關的黃色脂肪瘤（xanthoma）之敘述，下列何者錯誤？
A. 只有血液中低密度脂蛋白膽固醇（LDL cholesterol）過高時才會發生，與血液中甘油三脂（triglyceride）的濃度無關
B. 常分布在皮下（subcutaneous）處
C. 常分布在肌腱鞘（tendon sheath）處
D. 常分布在身體四肢的伸肌表面（extensor surface）

正確答案：A. 只有血液中低密度脂蛋白膽固醇（LDL cholesterol）過高時才會發生，與血液中甘油三脂（triglyceride）的濃度無關